Clinical trial inclusion criterion:
No use of non-steroid anti-inflammatory agent one week before operation

Annotated entities:
- Drug: "non-steroid anti-inflammatory agent"
- Temporal: "one week before operation"
- Reference_point: "operation"
- Negation: "No"